Clinical trial inclusion criterion:
Alcohol abuse

Annotated entities:
- Condition: "Alcohol abuse"